在考慮到先天性代謝性疾病時，下列那種疾病較容易血氨（ammonia）昇高，而 pH 值及 HCO3-均正常？
A. Urea cycle defects
B. Phenylketonuria
C. Hawkinsinuria
D. methylmalonic acidemia

正確答案：A. Urea cycle defects